Clinical trial exclusion criterion:
Subject has back or non-radicular leg pain of unknown etiology.

Entity relations:
- Has_qualifier("back pain", "unknown etiology")
- OR("back pain", "non-radicular leg pain")